一位病人因腹瀉而來就醫。他自3天前開始腹瀉，大多為水狀排泄物，每天至少十次，偶而伴有腹痛，同時發 6oC，acetaminophen可稍退燒，但會再燒。他沒有噁心、嘔吐，但因怕腹瀉而不敢進食及喝水。下列各項敘述，何者錯誤？
A. 他可能有感染性腹瀉（infectious diarrhea），應趕快檢查其病因
B. 其大便應送檢，包括pus cells及parasites ova，甚至細菌及病毒培養
C. 除了補充水份，應立即給予強力止瀉藥以遏止腹瀉
D. 若大便檢查發現pus cells，在正式病原尚未確定之前，試用抗生素（如quinolone或metronidazole）是合宜的

正確答案：C. 除了補充水份，應立即給予強力止瀉藥以遏止腹瀉